Clinical trial exclusion criterion:
PMH of diagnosed heart, kidney, peripheral vascular, or cerebral vascular disease, or diabetes mellitus;

Entity relations:
- OR("heart disease", "kidney disease", "peripheral vascular, disease", "diabetes mellitus", "cerebral vascular disease")